other drugs that interact with 3HP (see Table 1)

The above is a clinical trial exclusion criterion. Annotated with entity spans:
[Non-query-able: other drugs that interact with 3HP (see Table 1)]